21歲女性因為左下腹痛求診，內診發現左側卵巢腫大，超音波檢查顯示左側卵巢實質腫瘤，而內含物似乎是骨頭及牙齒。這類腫瘤約有多少百分比是雙側性？
A. 小於1%
B. 2%～3%
C. 10%～15%
D. 50%

正確答案：C. 10%～15%